La velocidad de la cadena de transporte de electrones:
1. Depende de la concentración de oxígeno.
2. Aumenta cuando aumenta la concentración de ATP.
3. Está determinada por la necesidad de ATP.
4. Es independiente de la fosforilación de ADP.
5. Aumenta cuando se eleva la concentración de NADH y FADH2. 6.

Respuesta correcta: 3. Está determinada por la necesidad de ATP.